predicted ICU stay more than 7 days

The above is a clinical trial inclusion criterion. Annotated with entity spans:
[Observation: predicted ICU stay] [Value: more than 7 days]